Clinical trial exclusion criterion:
Other heart conditions being treated by a physician

Annotated entities:
- Condition: "Other heart conditions"